Isotocin is an homolog of what hormone?

Isotocin is a homolog of oxytocin.